Clinical trial exclusion criterion:
Known hypersensitivity to statin

Annotated entities:
- Condition: "hypersensitivity"
- Drug: "statin"